Clinical trial inclusion criteria:
Type of subject: outpatient.
Informed consent: Subjects must give their signed and dated written informed consent to participate.
Gender: Male or female. Female subjects must be post-menopausal or using a highly effective method for avoidance of pregnancy. The decision to include or exclude women of childbearing potential may be made at the discretion of the investigator in accordance with local practice in relation to adequate contraception.
Age: >=40 and <=80 years of age at Screening (Visit 1).
Tobacco use: Subjects with a current or prior history of >=10 pack-years of cigarette smoking at screening (Visit 1). Previous smokers are defined as those who have stopped smoking for at least 6 months prior to Visit 1.
Airflow Obstruction:
Subjects with a measured post-albuterol/salbutamol forced expiratory volume in 1 second (FEV1)/(forced vital capacity)FVC ratio of <=0.70 at Screening (Visit 1).
Subjects with a measured post-albuterol/salbutamol FEV1 >=50 and <=70% of predicted normal values calculated using NHANES III reference equations [Hankinson, 1999; Hankinson, 2010] at Screening (Visit 1).
Post-bronchodilator spirometry will be performed approximately 15 minutes after the subject has self-administered 4 inhalations (i.e., total 400mcg) of albuterol/salbutamol via a metered dose inhaler (MDI )with a valved-holding chamber. The FEV1/FVC ratio and FEV1 percent predicted values will be calculated.
Symptoms of COPD: Subjects must score 2 or higher on the modified Medical Research Council Dyspnea scale (Visit 1)
Cardiovascular disease:
For patients >= 40 years of age: any one of the following:
Established (i.e. by clinical signs or imaging studies) coronary artery disease (CAD) Established (i.e. by clinical signs or imaging studies) peripheral vascular disease (PVD) Previous stroke Previous MI Diabetes mellitus with target organ disease OR
For patients >=60 years of age: any 2 of the following:
Being treated for hypercholesterolemia Being treated for hypertension Being treated for diabetes mellitus Being treated for peripheral vascular disease

Annotated entities:
- Visit: "outpatient"
- Post-eligibility: "Informed consent: Subjects must give their signed and dated written informed consent to participate."
- Person: "Male"
- Person: "female"
- Pregnancy_considerations: "Female subjects must be post-menopausal or using a highly effective method for avoidance of pregnancy. The decision to include or exclude women of childbearing potential may be made at the discretion of the investigator in accordance with local practice in relation to adequate contraception."
- Person: "Age"
- Value: ">=40 and <=80 years"
- Person: "age"
- Temporal: "at Screening"
- Reference_point: "Screening"
- Multiplier: ">=10 pack-years"
- Observation: "cigarette smoking"
- Temporal: "at screening"
- Temporal: "history"
- Temporal: "prior"
- Temporal: "current"
- Condition: "Previous smokers"
- Observation: "stopped smoking"
- Temporal: "for at least 6 months prior to Visit 1"
- Reference_point: "Visit 1"
- Parsing_Error: "Airflow Obstruction:"
- Drug: "albuterol"
- Drug: "salbutamol"
- Temporal: "post-albuterol/salbutamol"
- Measurement: "forced expiratory volume in 1 second (FEV1)/(forced vital capacity)FVC ratio"
- Value: "<=0.70"
- Temporal: "at Screening"
- Qualifier: "post-albuterol/salbutamol"
- Reference_point: "albuterol/salbutamol"
- Qualifier: "post-albuterol/salbutamol"
- Temporal: "post-albuterol/salbutamol"
- Drug: "albuterol"
- Drug: "salbutamol"
- Reference_point: "albuterol/salbutamol"
- Measurement: "FEV1"
- Value: ">=50 and <=70% of predicted normal values"
- Qualifier: "using NHANES III reference equations"
- Temporal: "at Screening"
- Reference_point: "Screening"
- Qualifier: "Post-bronchodilator"
- Temporal: "Post-bronchodilator"
- Drug: "bronchodilator"
- Reference_point: "bronchodilator"
- Procedure: "spirometry"
- Temporal: "approximately 15 minutes after"
- Multiplier: "4"
- Procedure: "inhalations"
- Qualifier: "self-administered"
- Multiplier: "400mcg"
- Drug: "albuterol"
- Drug: "salbutamol"
- Procedure: "metered dose inhaler (MDI )"
- Qualifier: "with a valved-holding chamber"
- Condition: "Symptoms of COPD"
- Value: "score 2 or higher"
- Measurement: "modified Medical Research Council Dyspnea scale"
- Parsing_Error: "Cardiovascular disease:"
- Value: ">= 40 years"
- Person: "age"
- Condition: "coronary artery disease (CAD)"
- Condition: "peripheral vascular disease (PVD)"
- Condition: "stroke"
- Temporal: "Previous"
- Observation: "Established"
- Observation: "clinical signs"
- Procedure: "imaging studies"
- Condition: "MI"
- Condition: "Diabetes mellitus"
- Condition: "target organ disease"
- Parsing_Error: "OR"
- Temporal: "Previous"
- Observation: "Established"
- Observation: "clinical signs"
- Procedure: "imaging studies"
- Value: ">=60 years"
- Person: "age"
- Condition: "hypercholesterolemia"
- Procedure: "treated for hypercholesterolemia"
- Procedure: "treated for hypertension"
- Condition: "hypertension"
- Condition: "diabetes mellitus"
- Procedure: "treated for diabetes mellitus"
- Procedure: "treated for peripheral vascular disease"
- Condition: "peripheral vascular disease"